En el bazo, los linfocitos T se localizan sobre todo en:
1. La zona marginal.
2. Los cordones medulares.
3. Los centros germinales.
4. Las vainas linfáticas periarteriolares.

Respuesta correcta: 4. Las vainas linfáticas periarteriolares.